Clinical trial inclusion criterion:
BMI < 45kg/m2

Entity relations:
- Has_value("BMI", "< 45kg/m2")